萊姆病（Lyme disease）的致病原，具有下列何種特徵？
A. 以端鞭毛（polar flagellum）進行泳動
B. 屬於微嗜氧性（microaerophilic）
C. 革蘭氏染色陽性
D. 可生長於一般培養基

正確答案：B. 屬於微嗜氧性（microaerophilic）